Clinical trial exclusion criterion:
Patients with chronic liver disease

Annotated entities:
- Procedure: "liver disease"
- Qualifier: "chronic"